Clinical trial exclusion criterion:
Unable to complete baseline testing, pre-existing neurological deficit

Entity relations:
- Has_qualifier("neurological deficit", "pre-existing")